以下關於弓蟲（Toxoplasma gondii）的敘述中，何者錯誤？
A. 人是其終宿主，而貓是其中間宿主
B. 在愛滋病患者可能導致弓蟲性腦炎（Toxoplasma  encephalitis）
C. 文獻記載，孕婦得到急性弓蟲症（toxoplasmosis）時，spiramycin為預防其胎兒子宮內感染的用藥之一
D. 弓蟲症在台灣屬第四類法定傳染病

正確答案：A. 人是其終宿主，而貓是其中間宿主